1. Male or female of any race, at least 18 years of age at Visit 1 Screening.

The above is a clinical trial inclusion criterion. Annotated with entity spans:
[Parsing_Error: 1.] [Person: Male] or [Person: female] of any race, [Value: at least 18 years] of [Person: age] [Temporal: at Visit 1 Screening].